Clinical trial exclusion criterion:
pregnant or nursing woman

Entity relations:
- AND("woman", "pregnant")
- OR("pregnant", "nursing")